36 歲男性病人，因長期應酬，每日平均喝半瓶烈酒已十年，近日因身體倦怠，食慾不佳，臉色發黃而住院，住院後發現總膽紅素高至 22 mg/dL，ALT 高至 226 U/L，AST 高至 282 U/L，GGT 高至 388 U/L，凝血機能 PT 延長大於 4 秒，INR 為 1.59，aPTT 比正常值稍高，以下何者為最適當之處置？
A. 立即準備作肝臟移植
B. 給予靜脈營養，並補充口服維生素
C. 為了避免出血，應大量給予 FFP（fresh frozen plasma）
D. 由於體內酒精濃度突然減少，易產生戒酒後症候群，仍應給予少量含酒精食物

正確答案：B. 給予靜脈營養，並補充口服維生素